Patients with known or suspected right-to-left, bi-directional, or transient right-to-left cardiac shunts

The above is a clinical trial exclusion criterion. Annotated with entity spans:
Patients with [Mood: known] or [Mood: suspected] [Condition: right-to-left], [Condition: bi-directional], or [Condition: transient right-to-left cardiac shunts]